Clinical trial exclusion criterion:
Patients for whom the need of pressure infusions are expected

Annotated entities:
- Non-representable: "Patients for whom the need of pressure infusions are expected"